許先生右腳腳趾感染併發蜂窩組織炎，為求控制感染，醫生為他執行右腳所有腳趾截肢手術（toe disarticulation）。下列何種鞋子的構造對其術後之步行最有幫助？
A. Thomas heel
B. Rocker bar
C. metatarsal bar
D. metatarsal pad

正確答案：B. Rocker bar